對抗細胞表面受體（cell surface receptors）的抗體，能夠引起器官破壞的自體免疫病，例如抗乙醯膽鹼受體抗體（anti-acetylcholine receptor antibody）能夠引起下列那一種疾病？
A. 重症肌無力（myasthenia gravis）
B. 尋常天疱瘡（pemphigus vulgaris）
C. 多發性硬化症（multiple sclerosis）
D. 紅斑性狼瘡（systemic lupus erythematosus）

正確答案：A. 重症肌無力（myasthenia gravis）